Clinical trial inclusion criterion:
Age = 75 years,

Annotated entities:
- Person: "Age"
- Value: "= 75 years"